Pregnant or breastfeeding women.

The above is a clinical trial exclusion criterion. Annotated with entity spans:
[Pregnancy_considerations: Pregnant or breastfeeding women].